腰椎	至骶椎 （sacrum）的脊柱弓在發育時期沒有癒合，會造成下列何種缺陷？
A. 隱性脊柱裂（Spina bifida occulta）
B. 水腦（Hydranencephaly）
C. Arnold-Chiari 氏畸形（Arnold-Chiari malformation）
D. 裂顱畸形（Cranium bifidum）

正確答案：A. 隱性脊柱裂（Spina bifida occulta）